Clinical trial exclusion criterion:
patients who do not wish to participate in the project;

Annotated entities:
- Post-eligibility: "patients who do not wish to participate in the project"